Cardiogenic shock of patient with KILLIP III or IV

The above is a clinical trial exclusion criterion. Annotated with entity spans:
[Condition: Cardiogenic shock] of patient with [Measurement: KILLIP] [Value: III or IV]